Clinical trial exclusion criterion:
Premenopausal women who are nursing or pregnant

Annotated entities:
- Condition: "Premenopausal"
- Person: "women"
- Condition: "nursing"
- Condition: "pregnant"